關於快速氣管插管步驟（rapid sequence intubation），下列敘述何者正確？
A. 為達快速氣管插管，插管前不應給任何鎮靜麻醉劑
B. 成人在氣管插管前，應先放置鼻胃管
C. 快速氣管插管不須等待人員、藥物以及裝備到齊後再進行，以節省時間
D. 氣管插管前，任何病人皆需給予高濃度的氧氣

正確答案：D. 氣管插管前，任何病人皆需給予高濃度的氧氣